下列何項藥物具有免疫調節、抗發炎和抗血管新生作用，它可抑制 TNF-α 作用，降低 neutrophil 之吞噬作用？
A. azathioprine
B. thalidomide
C. mycophenolate mofetil
D. cyclosporine

正確答案：B. thalidomide